Clinical trial inclusion criterion:
subjects in good health upon medical history, physical exam, and laboratory testing in the opinion of the investigator

Entity relations:
- Has_temporal("good health", "medical history")
- AND("good health", "physical exam")
- AND("good health", "laboratory testing")